Clinical trial inclusion criterion:
OSDI < 30 points

Annotated entities:
- Measurement: "OSDI"
- Value: "< 30 points"